有位55歲男性接受一般健檢時被意外發現 hemoglobin 6.0 g/dL（正常值13～17），MCV = 70 fL（正常值77～102），RBC  count = 200×104/mm3（正常值400～552×104）。仔細詢問病史，他並沒有明顯的活動性氣促（dyspnea on exertion, 
 DOE），但最近確實感到較無力，爬樓梯不能一口氣爬上四樓。他食慾如常，大便習慣並未改變，顏色也與平常差不多。下列各項敘述，何者錯誤？
A. 他的貧血病因應該不是thalassemia
B. hemoglobin electrophoresis應非需要優先安排檢查之項目
C. 應予以檢查大便潛血反應（fecal occult blood test, FOBT）
D. 不需要安排大腸檢查

正確答案：D. 不需要安排大腸檢查